¿Cuál de las siguientes asociaciones (enfermedad - síntoma o signo clínico) es incorrecta?
1. Sarampión - Manchas de Koplik.
2. Exantema súbito - Fiebre.
3. Eritema infeccioso - Anemia por aplasia medular.
4. Varicela - Adenopatías occipitales.
5. Escarlatina - Fiebre y disfagia.

Respuesta correcta: 4. Varicela - Adenopatías occipitales.